乘坐垂直昇降梯，在昇降梯加速與減速時，負責偵測身體之垂直位移，並引起適當反射以保持平衡之主要結構為何？
A. Utricle
B. Saccule
C. Semicircular ducts
D. Cochlea

正確答案：B. Saccule